Clinical trial exclusion criteria:
- Irregular menstrual cycle demanding preparing endometrium with hormones for frozen-thawed embryo
No frozen embryos after IVF cycle
Allergy to Pregnyl® or some of its ingredients in the medication or other contraindications due to Pregnyl®

Annotated entities:
- Condition: "Irregular menstrual cycle"
- Procedure: "preparing endometrium with hormones for frozen-thawed embryo"
- Procedure: "IVF cycle"
- Negation: "No"
- Observation: "frozen embryos"
- Condition: "Allergy"
- Drug: "Pregnyl"
- Drug: "some of its ingredients"
- Condition: "contraindications"
- Drug: "Pregnyl"